Clinical trial exclusion criterion:
Subject is pregnant or interested in becoming pregnant in the next two (2) years.

Annotated entities:
- Condition: "pregnant"
- Mood: "interested in becoming"
- Condition: "pregnant"
- Temporal: "in the next two (2) years"